男性不孕症最常見的染色體遺傳疾病為何？
A. 45XO
B. 46XX/46XY
C. 47XXY
D. 47XYY

正確答案：C. 47XXY